Mujer de 65 años de edad con antecedentes de dolores articulares en tratamiento con antiinflamatorios, que es remitida a estudio por presentar anemia. En los estudios complementarios presenta hematíes 3.164.000, Hto. 32%, Hb 11 g/dl, VCM 69 fl, Leucocitos 7800, Plaquetas 370.000, PCR 0,29 mg/dl, Fe 20 ng/ml, Ferritina 18 ng/ml, Glucosa 105 mg/dl, GOT, GPT, GGT, F. Alcalina, Bilirrubina total, Colesterol, Creatinina, Calcio y Fósforo normales. Ac. Antitransglutaminasa y Ac antigliadina negativos. Gastroscopia: hernia de hiato de 3 cm, resto sin alteraciones. Colonoscopia: hasta ciego, aislados divertículos en sigma. Tránsito intestinal sin alteraciones. Ecografía de abdomen sin alteraciones. ¿Cuál de las exploraciones que se enumeran a continuación le parece más adecuada para completar el estudio?
1. Biopsia de yeyuno.
2. Arteriografía.
3. Cápsula endoscópica.
4. Radioisótopos.
5. RM pélvica.

Respuesta correcta: 3. Cápsula endoscópica.